18 years of age or older

The above is a clinical trial inclusion criterion. Annotated with entity spans:
[Value: 18 years] of [Person: age] or older